known for dexmedetomidine or other drugs allergy in this study.

The above is a clinical trial exclusion criterion. Annotated with entity spans:
known for [Drug: dexmedetomidine] or [Qualifier: other] [Drug: drugs] [Condition: allergy] in this study.